Clinical trial exclusion criterion:
Advanced heart block or sinus node dysfunction

Entity relations:
- Has_qualifier("heart block", "Advanced")
- OR("heart block", "sinus node dysfunction")